Premenopausal women

The above is a clinical trial inclusion criterion. Annotated with entity spans:
[Person: Premenopausal] [Person: women]